心室肌細胞的動作電位變化，可分第零期：去極化（depolarization）；第一期：快速再極化（rapid repolarization）；第二期：持續的高原期（plateau）；第三期：最終的再極化（final repolarization）；第四期：靜止膜電位（resting membrane potential）。關於鉀離子通道角色的敘述，下列何者是正確的？
A. 第零期的機制之一是鉀離子通道的關閉
B. 第一期的機制之一是鉀離子通道關閉
C. 在第二期中，所有的鉀離子通道會完全關閉
D. 引發第三期的主要因素是鉀離子通道開啟

正確答案：D. 引發第三期的主要因素是鉀離子通道開啟